Known renal impairment

The above is a clinical trial exclusion criterion. Annotated with entity spans:
Known [Condition: renal impairment]